El estado crepuscular implica:
1. La ausencia total de conciencia que se produce en trastornos circulatorios, cuadros tóxicos y traumatismos cerebrales.
2. Una ausencia total de conciencia, que es reversible si se llama al paciente por su nombre.
3. Un estrechamiento de la conciencia, con un enfoque atencional hacia vivencias interiores.
4. Una ausencia de conciencia que se acompaña de una intensa contracción muscular.

Respuesta correcta: 3. Un estrechamiento de la conciencia, con un enfoque atencional hacia vivencias interiores.